Which two genes are predominantly considered by warfarin initial dosing algorithms?

Polymorphisms in CYP2C9 and VKORC1 are taken into consideration by warfarin initial dosing algorithms.